Clinical trial exclusion criterion:
Hip dysplasia (center edge angle < 20° on AP radiograph)

Annotated entities:
- Condition: "Hip dysplasia"
- Measurement: "center edge angle"
- Value: "< 20°"
- Procedure: "AP radiograph"